Clinical trial inclusion criterion:
the last vaccination intervals = 14 days and the last attenuated live vaccine intervals=28days

Entity relations:
- Has_value("last vaccination intervals", "= 14 days")
- Has_value("last attenuated live vaccine intervals", "=28days")